Clinical trial inclusion criterion:
Atrial fibrillation on sub-optimal OAC

Entity relations:
- Has_qualifier("OAC", "sub-optimal")